Clinical trial exclusion criteria:
Previous thoracic operation in the same side.

Annotated entities:
- Temporal: "Previous"
- Procedure: "thoracic operation"
- Qualifier: "same side"